Clinical trial inclusion criteria:
Men or women at least 19 years of age
Type 2 diabetes mellitus
Stable coronary artery disease
Global myocardial perfusion reserve (MPR) index < 2.5
The patient or guardian agrees to the study protocol and the schedule of clinical and dynamic SPECT follow-up, and provides informed, written consent, as approved by the appropriate Institutional Review Board/Ethical Committee of the respective clinical site.

Annotated entities:
- Person: "Men"
- Person: "women"
- Value: "at least 19 years"
- Person: "age"
- Condition: "Type 2 diabetes mellitus"
- Condition: "coronary artery disease"
- Qualifier: "Stable"
- Measurement: "Global myocardial perfusion reserve (MPR) index"
- Value: "< 2.5"
- Informed_consent: "informed, written consent"